24 歲女性這 3 星期斷斷續續出現複視症狀，用餐一段時間後會覺得咀嚼無力及吞嚥困難，必須休息半小時才能繼續用餐，今天因為呼吸困難至急診室就診，下列有關的敘述，何者較適當？
A. 此病在冬季時會更加嚴重
B. 若欲快速診斷，使用 pyridostigmine 試驗會比 edrophonium 試驗為佳
C. 若病患罹患急性腎盂炎時，可給予 gentamicin
D. 使用藥物治療中的病患，若出現流涎、喘鳴呼吸音（wheezing）、緩脈（bradycardia）時可用 atropine 治療

正確答案：D. 使用藥物治療中的病患，若出現流涎、喘鳴呼吸音（wheezing）、緩脈（bradycardia）時可用 atropine 治療